Signed informed consent form

The above is a clinical trial inclusion criterion. Annotated with entity spans:
[Informed_consent: Signed informed consent form]